關於黃疸（jaundice）之敘述，下列何者錯誤？
A. 膽紅素主要是血紅素分解的代謝物
B. 未結合型膽紅素經由肝細胞作用變成結合型膽紅素，接著經由膽管排出
C. 膽紅素的半衰期約 4 小時，但與白蛋白結合的膽紅素半衰期約 3 天
D. 血清正常膽紅素小於 1 mg/dL，直接型膽紅素約占 30%

正確答案：C. 膽紅素的半衰期約 4 小時，但與白蛋白結合的膽紅素半衰期約 3 天